Paracetamol ingestion in the previous 48 hours

The above is a clinical trial exclusion criterion. Annotated with entity spans:
[Drug: Paracetamol] ingestion [Temporal: in the previous 48 hours]